Clinical trial exclusion criterion:
Monitored Anesthesia Care (i.e., regional anesthesia alone without plans for general anesthesia)

Entity relations:
- Has_mood("general anesthesia", "plans for")
- Has_negation("general anesthesia", "without")
- Has_multiplier("regional anesthesia", "alone")
- AND("regional anesthesia", "general anesthesia")
- Subsumes("Monitored Anesthesia Care", "regional anesthesia")